Active peptic ulceration or gastrointestinal bleeding.

The above is a clinical trial exclusion criterion. Annotated with entity spans:
[Temporal: Active] [Condition: peptic ulceration] or [Condition: gastrointestinal bleeding].